Clinical trial exclusion criterion:
preexisting cognitive deficits, dementia, or delirium

Annotated entities:
- Condition: "cognitive deficits"
- Condition: "dementia"
- Condition: "delirium"